Clinical trial inclusion criterion:
Sensation of anorectal obstruction/blockage for =25% of defecations

Entity relations:
- Has_multiplier("defecations", "=25%")
- AND("Sensation of anorectal obstruction", "defecations")
- OR("Sensation of anorectal obstruction", "Sensation of anorectal blockage")